Clinical trial exclusion criteria:
Patients with a history of drug abuse;
preoperative history of schizophrenia, epilepsy, parkinsonism, use of cholinesterase inhibitor, inability to communicate in the preoperative period (coma, profound dementia, or language barrier).

Annotated entities:
- Condition: "drug abuse"
- Temporal: "history"
- Temporal: "history"
- Condition: "schizophrenia"
- Temporal: "preoperative"
- Condition: "epilepsy"
- Condition: "parkinsonism"
- Drug: "cholinesterase inhibitor"
- Condition: "inability to communicate"
- Condition: "coma"
- Condition: "profound dementia"
- Condition: "language barrier"